Clinical trial exclusion criterion:
history of major systemic illness, including uncontrolled hypertension, diabetes, chronic renal insufficiency, autoimmune diseases or malignancies

Entity relations:
- Has_qualifier("systemic illness", "major")
- Has_qualifier("hypertension", "uncontrolled")
- Subsumes("systemic illness", "hypertension")
- OR("hypertension", "autoimmune diseases", "chronic renal insufficiency,", "diabetes", "malignancies")